有關攝護腺癌之敘述，下列何者錯誤？
A. 腫瘤細胞形成的腺體構造，通常比正常的腺體小
B. 腫瘤腺體構造可由單層細胞組成
C. 腫瘤細胞常見大量有絲分裂
D. 轉移的位置常出現在骨盆淋巴結及脊椎骨

正確答案：C. 腫瘤細胞常見大量有絲分裂